Mujer de 31 años con antecedentes de cólico nefrítico hace 4 años que consulta en urgencias por dolor lumbar izquierdo de características cólicas desde hace 3 días con aparición de fiebre durante las últimas 12 horas. En el análisis de sangre destacan la presencia de 15.000 leucocitos/uL, 85% neutrófilos, creatinina 0,8 mg/dL y PCR 20 mg/dL. El sedimento de orina informa de incontables leucocitos/campo. ¿Cuál de las siguientes aseveraciones es cierta?
1. Dado que se trata de una infección urinaria no complicada, debemos tratarla con antibioterapia oral y control evolutivo.
2. Es recomendable realizar un estudio de imagen urgente para descartar obstrucción de la vía urinaria alta que requiera drenaje.
3. Esta paciente tiene una infección del tracto urinario complicada y lo más probable es que el germen causante sea S. aureus.
4. Lo más indicado es iniciar tratamiento con fluconazol y controlarla en consulta externa en 1 semana.
5. La paciente tiene una pielonefritis aguda y el tratamiento óptimo es la combinación de sondaje      vesical      con     antibioterapia endovenosa.

Respuesta correcta: 2. Es recomendable realizar un estudio de imagen urgente para descartar obstrucción de la vía urinaria alta que requiera drenaje.